Must accept treatment plan

The above is a clinical trial inclusion criterion. Annotated with entity spans:
[Informed_consent: Must accept treatment plan]